Clinical trial inclusion criterion:
A positive history of chronic claudication,

Annotated entities:
- Temporal: "positive history"
- Condition: "chronic claudication"